uncontrolled depression

The above is a clinical trial exclusion criterion. Annotated with entity spans:
[Qualifier: uncontrolled] [Condition: depression]